QTcF > 500 msec

The above is a clinical trial exclusion criterion. Annotated with entity spans:
[Measurement: QTcF] [Value: > 500 msec]